Experience with pump-assisted infusions of IgPro20 at tolerated volumes of 25 mL/injection site for at least 1 month prior to Day 1.

The above is a clinical trial inclusion criterion. Annotated with entity spans:
Experience with [Qualifier: pump-assisted infusions] of [Drug: IgPro20] at [Qualifier: tolerated] [Multiplier: volumes of 25 mL/injection site] [Temporal: for at least 1 month prior to Day 1].